Un plásmido contiene necesariamente:
1. Genes de resistencia a antibióticos.
2. Origen de replicación.
3. Integrones.
4. Genes de trasferencia por conjugación.
5. Transposones.

Respuesta correcta: 2. Origen de replicación.